Clinical trial exclusion criterion:
Excessive alcohol use (>14 drinks/week)

Annotated entities:
- Observation: "alcohol use"
- Multiplier: ">14 drinks/week"